Clinical trial exclusion criterion:
Participant has received a community available influenza vaccine within <6 months

Entity relations:
- Has_temporal("influenza vaccine", "within <6 months")